Clinical trial inclusion criterion:
Parents who agree to complete documentation and follow up at 14 days post-operation.

Annotated entities:
- Informed_consent: "Parents who agree to complete documentation and follow up at 14 days post-operation."